Clinical trial exclusion criterion:
Have characteristics contraindicating metformin or sulfonylurea use.

Annotated entities:
- Drug: "metformin"
- Drug: "sulfonylurea"
- Condition: "characteristics contraindicating"